Clinical trial exclusion criterion:
Presence of ocular or systemic disease or need of medications which might interfere with contact lens wear.

Entity relations:
- Has_qualifier("ocular disease", "might interfere with contact lens wear")
- OR("ocular disease", "need of medications", "systemic disease")